Clinical trial exclusion criterion:
Patients with acute gastrointestinal bleeding

Entity relations:
- Has_qualifier("gastrointestinal bleeding", "acute")